undergoing anterior spine multi-level instrumentation surgery

The above is a clinical trial exclusion criterion. Annotated with entity spans:
[Temporal: undergoing] [Qualifier: anterior spine] [Procedure: multi-level instrumentation surgery]